Which factors contribute to the risk of very-early-onset inflammatory bowel disease?

Very-early-onset inflammatory bowel disease (VEO-IBD) is a heterogeneous phenotype associated with a spectrum of rare Mendelian disorders. Somatic mosaicism and common genetic variation contribute to the risk of this disease.